Male subjects with female partners of child-bearing potential must agree to use one of the contraception methods listed in Protocol. This criterion must be followed from the time of the first dose of study medication until the follow-up contact visit.

The above is a clinical trial inclusion criterion. Annotated with entity spans:
[Context_Error: Male subjects with female partners of child-bearing potential must agree to use one of the contraception methods listed in Protocol.] [Parsing_Error: This criterion must be followed from the time of the first dose of study medication until the follow-up contact visit.]